Male or pre-menarchial female subjects.

The above is a clinical trial inclusion criterion. Annotated with entity spans:
[Person: Male] or [Person: pre-menarchial] [Person: female] subjects.